王先生奉派駐任中非共和國外交官服務二年，近日因腹部腫脹及週期性發燒而返國就醫，經醫師檢查發現有肝脾腫大（hepatosplenomegaly）及貧血（anemia）病癥，住院後進行骨髓穿刺可見巨噬細胞內有寄生物。依據上述結果，王先生最可能感染何種寄生蟲？
A. 杜氏利什曼原蟲（Leishmania donovani）
B. 熱帶利什曼原蟲（Leishmania tropica）
C. 岡比亞錐蟲（Trypanosoma brucei gambiense）
D. 枯西氏錐蟲（Trypanosoma cruzi）

正確答案：A. 杜氏利什曼原蟲（Leishmania donovani）